Clinical trial inclusion criterion:
Life-expectancy > 6 months.

Entity relations:
- Has_value("Life-expectancy", "> 6 months")